Patients with hepatic artery chemoembolization within the last 6 months (one month if there are other sites of measurable disease)

The above is a clinical trial exclusion criterion. Annotated with entity spans:
Patients with [Procedure: hepatic artery chemoembolization] [Temporal: within the last 6 months] ([Temporal: one month] if there are [Observation: other sites of measurable disease])